Diagnosis of prostate adenocarcinoma histologically confirmed at MSKCC.

The above is a clinical trial inclusion criterion. Annotated with entity spans:
Diagnosis of [Condition: prostate adenocarcinoma] [Qualifier: histologically confirmed] at MSKCC.